HBsAg and HBeAg positive for more than 6 months, HBV DNA detectable with ALT level abnormal lasted for three months and at least time190 IU/L or liver puncture biopsy demonstrated apparent inflammation, never treated before enrolled.

The above is a clinical trial inclusion criterion. Annotated with entity spans:
[Condition: HBsAg] and [Condition: HBeAg positive] [Temporal: for more than 6 months], [Condition: HBV DNA detectable] with [Measurement: ALT level] [Value: abnormal] [Temporal: lasted for three months] and [Temporal: at least time][Value: 190 IU/L] or [Procedure: liver puncture biopsy] demonstrated apparent [Condition: inflammation], [Negation: never] [Procedure: treated] [Temporal: before enrolled].